Clinical trial exclusion criterion:
Long-life DSM-IV axis 1 disorders.

Annotated entities:
- Condition: "Long-life DSM-IV axis 1 disorders"